Clinical trial exclusion criterion:
Other spinal pathology or other associated medical condition

Annotated entities:
- Condition: "spinal pathology"
- Condition: "associated medical condition"